En el reclutamiento de leucocitos desde la sangre a los tejidos, la selectinas se unen a:
1. Integrinas.
2. Estructuras glucídicas.
3. ICAM-1.
4. VCAM-1.

Respuesta correcta: 2. Estructuras glucídicas.